下列何種疾病的發生與石棉塵肺症（asbestosis）較沒有相關？
A. 纖維疤塊（fibrous plaque）
B. 肺淋巴瘤
C. 肺上皮癌
D. 間皮瘤（mesothelioma）

正確答案：B. 肺淋巴瘤